HEALTHY: normal cardiac structure and function on echocardiography, BP < 140/90

The above is a clinical trial inclusion criterion. Annotated with entity spans:
[Condition: HEALTHY]: [Value: normal cardiac structure] and function on [Procedure: echocardiography], [Measurement: BP] [Value: < 140/90]